¿Cuál de los siguientes átomos proporciona el enlace de hidrógeno más fuerte en los correspondientes hidruros?
1. F.
2. Cl.
3. O.
4. S.
5. P.

Respuesta correcta: 1. F.